La cola poliA o de poliadenilato es una secuencia típica de las células eucariotas que se encuentra en los siguientes ácidos nucleicos:
1. En el DNA y en el RNA mensajero maduro.
2. En el DNA y en el RNA de transferencia maduro.
3. En el RNA mensajero maduro.
4. En el RNA ribosomal maduro.

Respuesta correcta: 3. En el RNA mensajero maduro.